significant unstable or uncontrolled medical/psychiatric disease

The above is a clinical trial exclusion criterion. Annotated with entity spans:
[Qualifier: significant] [Qualifier: unstable] or [Qualifier: uncontrolled] [Condition: medical]/[Condition: psychiatric disease]